Clinical trial inclusion criterion:
Patient in sepsis and colistin was administered empirically to increase antibiotic coverage.

Annotated entities:
- Condition: "sepsis"
- Drug: "colistin"
- Procedure: "administered empirically"